Clinical trial inclusion criterion:
1. Individuals scheduled for undergoing colonoscopy at the Endoscopy Center of Wuxi people's Hospital in China

Annotated entities:
- Visit: "Endoscopy Center of Wuxi people's Hospital in China"
- Procedure: "colonoscopy"
- Non-query-able: "scheduled for undergoing"
- Parsing_Error: "1."